一位 52 歲的男性病人因上腹疼痛、盜汗至急診就診，理學檢查發現血壓為 88/58 mmHg，心跳 112/分，兩側肺部無囉音，無心雜音。下列何種處置最不適當？
A. 立即施行胸部及腹部 X 光檢查
B. 立即施行心電圖檢查
C. 立即給予靜脈滴注生理食鹽水
D. 立即給予靜脈注射 Butylscopolamine（Buscopan）

正確答案：D. 立即給予靜脈注射 Butylscopolamine（Buscopan）